下列何種激素須經由細胞膜上受體才能產生作用？
A. Glucocorticoid
B. Thyroid hormone
C. Insulin
D. Estrogen

正確答案：C. Insulin